High blood cholesterol diagnosed by a doctor

The above is a clinical trial exclusion criterion. Annotated with entity spans:
[Condition: High blood cholesterol] diagnosed by a doctor